Ability to understand and willingness to comply with the study protocol

The above is a clinical trial inclusion criterion. Annotated with entity spans:
[Non-query-able: Ability to understand and willingness to comply with the study protocol]